Clinical trial exclusion criterion:
Coagulopathies diagnosed by a physician or report of capillary fragility (ex: bruises or bleedings without justifiable cause;

Annotated entities:
- Condition: "Coagulopathies"
- Condition: "capillary fragility"
- Condition: "bruises"
- Condition: "bleedings"
- Qualifier: "without justifiable cause"
- Non-query-able: "without justifiable cause"